Trauma or extensive surgery within 1 month before randomization or surgery planned in the next 6 months after randomization.

The above is a clinical trial exclusion criterion. Annotated with entity spans:
[Condition: Trauma] or [Procedure: extensive surgery] [Temporal: within 1 month before randomization] or [Procedure: surgery] [Mood: planned] [Temporal: in the next 6 months after randomization].